Clinical trial exclusion criterion:
Subjects currently taking medications that affect heart rate and rhythm (i.e. Ca++ channel blockers, nitrates, alpha- or beta-blockers).

Annotated entities:
- Drug: "medications"
- Qualifier: "that affect heart rate"
- Qualifier: "that affect heart rhythm"
- Drug: "Ca++ channel blockers"
- Drug: "nitrates"
- Drug: "alpha- blockers"
- Drug: "beta-blockers"